Clinical trial exclusion criterion:
other new standards of exclusion criteria for first needle

Annotated entities:
- Non-query-able: "other new standards of exclusion criteria for first needle"